Pregnancy or childbearing potential without adequate contraception

The above is a clinical trial exclusion criterion. Annotated with entity spans:
[Condition: Pregnancy] or [Observation: childbearing potential] [Negation: without] [Qualifier: adequate] [Procedure: contraception]